Clinical trial exclusion criterion:
Unable to understand or sign consent form

Annotated entities:
- Post-eligibility: "Unable to understand or sign consent form"